Clinical trial inclusion criterion:
Acute exacerbation of bronchiectasis;

Annotated entities:
- Condition: "Acute exacerbation of bronchiectasis"